Clinical trial exclusion criterion:
History of severe allergy to Iodine contrast agents

Entity relations:
- AND("allergy", "Iodine contrast agents")